Clinical trial inclusion criterion:
ECOG Performance status0-2

Entity relations:
- Has_value("ECOG Performance status", "0-2")